Clinical trial exclusion criterion:
Pneumothorax in the two weeks prior to Visit 2

Annotated entities:
- Condition: "Pneumothorax"
- Temporal: "in the two weeks prior to Visit 2"
- Reference_point: "Visit 2"